一位 52 歲男性病患因咳嗽一星期就醫，胸部 X 光攝影發現右下肺野有一懷疑為腫瘤之病灶；另血液例行檢驗亦發現有貧血現象：Hb 9 gm/dL，MCV 72 fL（Normal：80-100）。下列何種檢驗無助於診斷？
A. serum vitamin B12
B. serum ferritin
C. serum Hb electrophoresis
D. Hb H stain

正確答案：A. serum vitamin B12